La rama ascendente del asa de Henle es impermeable al:
1. Sodio.
2. Calcio.
3. Cloruro.
4. Agua.

Respuesta correcta: 4. Agua.